Healthy volunteer without significant medical problems

The above is a clinical trial inclusion criterion. Annotated with entity spans:
[Qualifier: Healthy] [Person: volunteer] without significant medical problems